Clinical trial exclusion criterion:
Albumin < 3g/dL.

Entity relations:
- Has_value("Albumin", "< 3g/dL")